Atosiban屬於何種機轉的安胎藥物？
A. 前列腺素抑制劑（prostaglandin inhibitor）
B. 鈣通道阻斷劑（calcium-channel blocker）
C. 催產素類似物（oxytocin analog）
D. 腎上腺素接受器促效藥（β-adrenergic receptor agonist）

正確答案：C. 催產素類似物（oxytocin analog）